肺結核開刀的適應症不包括下列何項？
A. 經藥物治療 6 個月後，仍培養出結核菌且 X 光仍有開洞
B. 下肺葉的肺結核支氣管擴張症
C. 無法排除癌症的可能性時
D. 雙側多處肺結核病灶

正確答案：D. 雙側多處肺結核病灶